Clinical trial exclusion criterion:
Severe heart failure or cardiogenic shock

Annotated entities:
- Qualifier: "Severe"
- Condition: "heart failure"
- Condition: "cardiogenic shock"